Clinical trial exclusion criterion:
Persons directly involved in the execution of this protocol.

Annotated entities:
- Non-query-able: "Persons directly involved in the execution of this protocol."